Available for follow-up for the planned duration of the study

The above is a clinical trial inclusion criterion. Annotated with entity spans:
[Post-eligibility: Available for follow-up for the planned duration of the study]